As of 2019, what type of cancer is commonly associated with ionizing radiation

radiation- induced breast cancer